Clinical trial exclusion criterion:
contraindication to regional anaesthesia (coagulopathies, concurrent anticoagulant therapy, allergy to local anaesthetics, infection at puncture site)

Entity relations:
- AND("contraindication", "regional anaesthesia (")
- Has_qualifier("infection", "puncture site")
- AND("allergy", "local anaesthetics")
- Subsumes("contraindication", "coagulopathies")
- OR("coagulopathies", "allergy", "anticoagulant therapy", "infection")